8歲男孩出現發燒、喉嚨痛症狀，身體檢查發現兩側頸部淋巴腺腫大，咽喉與扁桃腺發炎。常規血液檢查發現白血球數上升，其中70%為淋巴細胞，淋巴細胞之中30%為非典型淋巴細胞。血中IgM嗜異性抗體（IgM  heterophil antibody）與抗Epstein -Barr病毒IgM抗體呈陽性反應。此非典型淋巴細胞最可能是下列何種細胞？
A. CD4陽性的T淋巴細胞
B. CD8陽性的T淋巴細胞
C. NK-T細胞
D. B淋巴細胞

正確答案：B. CD8陽性的T淋巴細胞